下列何種病毒之抗體測定是目前捐血時必須檢驗的項目？
A. Hepatitis A virus
B. Hepatitis C virus
C. Hepatitis E virus
D. Hepatitis D virus

正確答案：B. Hepatitis C virus